Clinically diagnosed of Port-wine Stain;

The above is a clinical trial inclusion criterion. Annotated with entity spans:
Clinically diagnosed of [Condition: Port-wine Stain];